Clinical trial exclusion criteria:
History of seizures within last 10 years
History of epilepsy
History of prior stroke
Currently prescribed medication with anti-epileptic activity (keppra, dilantin, tegretol, lamictal, topamax, etc.)
Brain tumor
Pregnant or nursing woman
Known levetiracetam allergy

Annotated entities:
- Condition: "seizures"
- Temporal: "within last 10 years"
- Condition: "epilepsy"
- Condition: "stroke"
- Temporal: "prior"
- Drug: "medication"
- Qualifier: "anti-epileptic activity"
- Drug: "keppra"
- Drug: "dilantin"
- Drug: "tegretol"
- Drug: "lamictal"
- Drug: "topamax"
- Condition: "Brain tumor"
- Condition: "Pregnant"
- Condition: "nursing"
- Person: "woman"
- Drug: "levetiracetam"
- Condition: "allergy"